急診處進來一位發生弛緩性麻痺（flaccid paralysis）的病人，研判是因食入臘腸桿菌（Clostridium botulinum）污染之食物所致。則此菌之毒素（botulinum toxin）造成疾病之主因是：
A. 抑制宿主細胞蛋白質合成
B. 抑制乙醯膽鹼的釋放，阻斷周邊膽鹼性神經突觸的神經傳遞
C. 干擾宿主細胞離子之通透性，造成細胞脫水
D. 分解宿主細胞之核糖體，阻斷酵素合成

正確答案：B. 抑制乙醯膽鹼的釋放，阻斷周邊膽鹼性神經突觸的神經傳遞